Clinical trial inclusion criteria:
Women with PCOS as defined by the Rotterdam criteria.
Presence of at least 2 cryopreserved good quality cleavage-stage embryo (good quality cleavage-stage embryos display stage-specific cell division, have blastomeres of fairly equal size with few to no cytoplasmic fragments).

Annotated entities:
- Condition: "PCOS"
- Person: "Women"
- Measurement: "Rotterdam criteria"
- Multiplier: "at least 2"
- Observation: "cleavage-stage embryo"
- Qualifier: "good"
- Qualifier: "cryopreserved"